Clinical trial exclusion criterion:
Use of any vaccine type within 30 days before the vaccination of the study;

Annotated entities:
- Drug: "any vaccine type"
- Temporal: "within 30 days before the vaccination of the study"
- Reference_point: "the vaccination of the study"
- Undefined_semantics: "any vaccine type"